Clinical trial exclusion criterion:
Medical history of chronic psychiatric disease

Entity relations:
- Has_temporal("chronic psychiatric disease", "history")